women undergoing caesarean section at less than 37 weeks of gestation.

The above is a clinical trial exclusion criterion. Annotated with entity spans:
[Person: women] [Temporal: undergoing] [Procedure: caesarean section] at [Value: less than 37 weeks] of [Measurement: gestation].